La estimulación de los barorreceptores carotídeos induce:
1. Bradicardia.
2. Vasoconstricción.
3. Incremento de la presión arterial.
4. Aumento del volumen minuto cardiaco.

Respuesta correcta: 1. Bradicardia.